有關人類乳突瘤病毒（human papilloma virus, HPV）與頭頸癌相關性的敘述，下列何者錯誤？
A. 在各個頭頸次部位中，與HPV相關性最高的是口咽癌（oropharyngeal cancer）
B. 在所有的HPV亞型中，以第16型與頭頸癌的關係最為密切
C. HPV產生的E6蛋白質會抑制p53的功能，E7蛋白質則會抑制pRb的功能
D. HPV陽性的口咽癌對化學治療及放射治療的反應及預後較差

正確答案：D. HPV陽性的口咽癌對化學治療及放射治療的反應及預後較差